Clinical trial inclusion criterion:
Standard-risk (SR) group meeting all of the following criteria:

Entity relations:
- Subsumes("Standard-risk", "SR")
- Has_multiplier("criteria", "all")
- AND("Standard-risk", "criteria")